Clinical trial exclusion criteria:
History of anti-vascular endothelial growth factor treatment in the past 12 months
Any diabetic macular edema treatment in the past 4 months
Heart attack, stroke, transient ischemic attack or acute congestive heart failure within 4 months

Annotated entities:
- Drug: "anti-vascular endothelial growth factor"
- Temporal: "in the past 12 months"
- Condition: "diabetic macular edema"
- Procedure: "treatment"
- Temporal: "in the past 4 months"
- Condition: "Heart attack"
- Condition: "stroke"
- Condition: "transient ischemic attack"
- Condition: "acute congestive heart failure"
- Temporal: "within 4 months"